Clinical trial inclusion criterion:
Aged over 18

Entity relations:
- Has_value("Aged", "over 18")